Clinical trial inclusion criterion:
All patients of childbearing and child-creating age must be using an acceptable form of birth control

Annotated entities:
- Post-eligibility: "All patients of childbearing and child-creating age must be using an acceptable form of birth control"